Previous enrolment into the current study

The above is a clinical trial exclusion criterion. Annotated with entity spans:
[Non-query-able: Previous enrolment into the current study]